周邊神經的損傷依據神經受損程度不同可分為三種性質，下列那一項不包括在內？
A. neurapraxia
B. neuromyotonia
C. axonotmesis
D. neurotmesis

正確答案：B. neuromyotonia